Clinical trial exclusion criterion:
any presence of serious medical conditions ( esp. cardiac, renal, liver diseases)

Entity relations:
- Subsumes("serious medical conditions", "cardiac diseases")
- OR("cardiac diseases", "renal diseases", "liver diseases")